王先生接受上下肢血壓的檢查，下肢dorsalis pedis artery收縮壓為90 mmHg，上臂測得的血壓為150/75 mmHg，平均血壓為100 mmHg，以下敘述何者正確？
A. ankle-brachial index為0.6
B. 因下肢少了舒張壓的資料，無法計算ankle-brachial index
C. ankle-brachial index為0.9
D. 因下肢測量部位為dorsalis pedis artery，無法計算ankle-brachial index

正確答案：A. ankle-brachial index為0.6